Patients who meet DSM-IV-TR criteria for any significant current substance abuse;

The above is a clinical trial exclusion criterion. Annotated with entity spans:
Patients who meet [Measurement: DSM-IV-TR] criteria for any significant current [Condition: substance abuse];